肺動脈瓣閉鎖合併心室中隔缺損（pulmonary atresia with ventricular septal defect）的病人，在接受初步手術時，所謂的單一化（unifocalization）是要將下列那些血管聚集在一起以準備第二階段手術之用？ ①自體的肺動脈（native pulmonary artery） ②主要的主動脈至肺動脈側枝循環（major aortopulmonary collateral arteries）  ③自體的肺靜脈（native pulmonary vein）  ④左冠狀動脈主支（left main coronary artery）
A. ①②
B. ①③
C. ②③
D. ①④

正確答案：A. ①②